聽覺受器位於下列何處？
A. middle ear
B. external auditory canal
C. tympanic membrane
D. inner ear

正確答案：D. inner ear